下列社區健康診斷的方法中，何者之成本高但可深入了解社區？
A. 質性調查，訪問社區的重要領袖
B. 檢視社區的二手資料，如社區的流行病資料
C. 以訪員作田野或家戶調查
D. 運用焦點團體方式，以了解社區居民的想法

正確答案：C. 以訪員作田野或家戶調查